Clinical trial exclusion criterion:
Any debilitating disease that causes exercise intolerance

Annotated entities:
- Condition: "debilitating disease"
- Condition: "exercise intolerance"